Clinical trial inclusion criterion:
Stable psychiatric medications and doses for the month prior to enrollment. Subjects may continue to engage in any ongoing psychotherapy.

Entity relations:
- Has_index("for the month prior to enrollment", "enrollment")
- Has_temporal("psychiatric medications", "for the month prior to enrollment")
- Has_multiplier("psychiatric medications", "Stable doses")
- Has_qualifier("psychiatric medications", "Stable")